Los antígenos T-independientes:
1. Son mayoritariamente proteínas.
2. Inducen maduración de la afinidad de los anticuerpos específicos.
3. Inducen cambio de isotipo de los anticuerpos específicos.
4. Suelen ser antígenos poliméricos.
5. Inducen intensas respuestas secundarias.

Respuesta correcta: 4. Suelen ser antígenos poliméricos.